Clinical trial exclusion criterion:
Previous allergy reactions to progesterone products

Annotated entities:
- Condition: "allergy"
- Drug: "progesterone products"